Ex-smokers over five years;

The above is a clinical trial inclusion criterion. Annotated with entity spans:
[Condition: Ex-smokers] [Temporal: over five years];